下列先天性兒童心臟病臨床表現，何者比較不會以發紺（cyanosis）表現？
A. PDA（patent ductus arteriosus）
B. TOF（tetralogy of Fallot）
C. TGV（transposition of the great vessels）
D. TA（truncus arteriosus）

正確答案：A. PDA（patent ductus arteriosus）